Clinical trial exclusion criterion:
Allergy or sensitivity to corticosteroids or any drug hypersensitivity or intolerance that would compromise patient safety or study results

Entity relations:
- multi("corticosteroids", "corticosteroids")
- Has_qualifier("Allergy", "corticosteroids")
- Has_qualifier("sensitivity", "corticosteroids")
- OR("drug hypersensitivity", "drug intolerance")
- OR("Allergy", "drug hypersensitivity")
- OR("sensitivity", "drug hypersensitivity")